Clinical trial inclusion criterion:
Eastern Cooperative Oncology Group (ECOG) performance status of 0, 1 or 2.

Entity relations:
- Has_value("Eastern Cooperative Oncology Group (ECOG) performance status", "0, 1 or 2")